Clinical trial exclusion criterion:
History of pancreatitis

Annotated entities:
- Condition: "pancreatitis"